Clinical trial inclusion criterion:
Patients having physical and mental ability to participate in the study

Annotated entities:
- Post-eligibility: "Patients having physical and mental ability to participate in the study"